有關腦下垂體泌乳素瘤（prolactinoma）的描述，下列何者正確？
A. 腫瘤通常直徑大於3公分
B. 血中泌乳素（prolactin）濃度通常>150 ng/mL
C. 手術是第一線主要治療方法
D. 直徑<1公分通常用立體定位放射線手術（SRS）治療

正確答案：B. 血中泌乳素（prolactin）濃度通常>150 ng/mL